Clinical trial exclusion criterion:
Pre-existing eye diseases (glaucoma).

Annotated entities:
- Condition: "eye diseases"
- Qualifier: "Pre-existing"
- Condition: "glaucoma"